右肺門（hilum）正後方的溝（或切跡）是由何結構造成的？
A. 食道
B. 動脈弓
C. 奇靜脈
D. 上腔靜脈

正確答案：A. 食道